6. Currently taking other medications thought to have an impact on immune system functioning, i.e., chemotherapeutic agents.

The above is a clinical trial exclusion criterion. Annotated with entity spans:
6. [Temporal: Currently] taking [Qualifier: other] [Drug: medications] thought to have an [Qualifier: impact on immune system functioning], i.e., [Drug: chemotherapeutic agents].